La DNA Girasa es:
1. Una Topoisomerasa I eucariótica.
2. Una Topoisomerasa II eucariótica
3. Una Topoisomerasa I procariótica.
4. Una Topoisomerasa II procariótica.
5. Una Helicasa procariótica.

Respuesta correcta: 4. Una Topoisomerasa II procariótica.